利用Precede-Proceed模式研擬病人高血壓衛生教育計畫時，評估病人對高血壓的認知、態度，是屬於下列何者因素評估？
A. 前傾因素（predisposing factor）
B. 增強因素（reinforcing factor）
C. 使能因素（enabling factor）
D. 教育因素（educational factor）

正確答案：A. 前傾因素（predisposing factor）